Clinical trial exclusion criterion:
Major surgery, other than diagnostic surgery, within 2 weeks.

Annotated entities:
- Procedure: "Major surgery"
- Procedure: "diagnostic surgery"
- Temporal: "within 2 weeks"
- Negation: "other than"